ages of 7 and 75 years

The above is a clinical trial inclusion criterion. Annotated with entity spans:
[Person: ages] of [Value: 7 and 75 years]